Subjects that are unable to lay flat due to pulmonary complications, increased intracranial pressure (ICP), or unstable spinal cord injuries

The above is a clinical trial exclusion criterion. Annotated with entity spans:
Subjects that are [Condition: unable to lay flat] [Qualifier: due to pulmonary complications], [Condition: increased intracranial pressure (ICP)], or [Qualifier: unstable] [Condition: spinal cord injuries]